Clinical trial exclusion criterion:
Patients who had received non-surgical periodontal treatment within the past 6 months

Annotated entities:
- Procedure: "non-surgical periodontal treatment"
- Temporal: "within the past 6 months"